Which yeast nucleosomes are preferentially marked by H2A.Z?

Yeast nucleosomes containing histone variant H2A.Z (Htz1p in yeast) are primarily composed of H4 K12ac and H3 K4me3.